關於糞便潛血（fecal occult blood testing，FOBT）的敘述，何者錯誤？
A. 對沒有危險因子的民眾是很好的大腸直腸癌篩檢工具
B. 藉由免疫反應檢測的糞便潛血其專一性較氧化還原法的糞便潛血檢測為高
C. 因為血球蛋白會在上消化道被破壞，所以免疫反應檢測的糞便潛血是來自於大腸或直腸的出血
D. 糞便潛血檢	前三天都必須要避免紅肉的攝取

正確答案：D. 糞便潛血檢	前三天都必須要避免紅肉的攝取